下列那一種肌細胞受到牽張（stretch）最可能會產生收縮？
A. 骨骼肌
B. 心肌
C. 小腸平滑肌
D. 大動脈平滑肌

正確答案：C. 小腸平滑肌